下列何者可用來區分傷寒桿菌（Salmonella typhi）與大腸桿菌（Escherichia coli）？
A. 發酵乳糖（lactose）的能力
B. 運動性（motility）
C. 還原硝酸鹽（nitrate）的能力
D. 產生芽胞（spores）的能力

正確答案：A. 發酵乳糖（lactose）的能力